Age = 75 years,

The above is a clinical trial inclusion criterion. Annotated with entity spans:
[Person: Age] [Value: = 75 years],